Multiple premature ventricular or atrial contractions

The above is a clinical trial exclusion criterion. Annotated with entity spans:
[Condition: Multiple premature ventricular] or atrial contractions